What are the 4 types of holoprosencephaly?

4 types of holoprosencephaly have been described: lobar, alobar, interhemispheric, sacral, and cerebellar.